Males planning to conceive a child during the study or within 6 months of cessation of treatment.

The above is a clinical trial exclusion criterion. Annotated with entity spans:
[Person: Males] [Mood: planning to] [Observation: conceive a child] [Temporal: during the study] or [Temporal: within 6 months of cessation of treatment].